Clinical trial exclusion criterion:
10. Current smoker.

Entity relations:
- Has_temporal("smoker", "Current")